Clinical trial exclusion criterion:
Patients in whom the preferred treatment is CABG(Coronary artery bypass grafting)

Annotated entities:
- Procedure: "CABG"
- Procedure: "Coronary artery bypass grafting"